1. Age: 12 to 36 months of age (The diagnosis of CP is often uncertain under the age of 12 months. The cutoff at 36 months is to have a population of young children when the brain is most "plastic" and most susceptible to reorganization).

The above is a clinical trial inclusion criterion. Annotated with entity spans:
[Parsing_Error: 1.] [Person: Age]: [Value: 12 to 36 months of age] [Not_a_criteria: (The diagnosis of CP is often uncertain under the age of 12 months. The cutoff at 36 months is to have a population of young children when the brain is most "plastic" and most susceptible to reorganization)].